Patients who cannot give informed consent,

The above is a clinical trial exclusion criterion. Annotated with entity spans:
[Non-query-able: Patients who cannot give informed consent,]